Who should wear dosimeters?

Nuclear medicine technologists rely on a single dosimeter to measure their work-related dose. Dosimetry for the study of medical radiation workers.